Señala el proceso FALSO respecto a cómo se degradan fundamentalmente los fármacos:
1. Hidrólisis y solvólisis.
2. Reducción.
3. Fotólisis.
4. Catálisis por oligoelementos metales.

Respuesta correcta: 2. Reducción.